Biliary strictures caused by confirmed benign tumors

The above is a clinical trial exclusion criterion. Annotated with entity spans:
[Condition: Biliary strictures] caused by [Qualifier: confirmed] [Condition: benign tumors]